產婦在分娩前後罹患水痘，可能造成嬰兒發生嚴重的水痘。其中，以何時發疹的產婦其嬰兒最危險？
A. 產前兩週以前
B. 產前一至二週
C. 產前五天迄產後二天內
D. 產後二天至一週內

正確答案：C. 產前五天迄產後二天內